Clinical trial exclusion criterion:
Contraindications for Lactobacillus Vaginal Suppositories(those without sexual history)

Annotated entities:
- Condition: "Contraindications"
- Drug: "Lactobacillus Vaginal Suppositories"
- Negation: "without"
- Temporal: "sexual history"